一位 62 歲男性病患於 1 週前接受心臟血管繞道手術，其心肺復健處方，下列何者最不適合？
A. 相較於心肌梗塞（myocardial infarction）的病患，通常可較早進行心肺復健
B. 此時可進行上半身肌力訓練，以改善日常生活功能
C. 此時可進行坐起、移位、步行等活動
D. 術後 2-3 週可進行運動測試

正確答案：B. 此時可進行上半身肌力訓練，以改善日常生活功能